Clinical trial exclusion criterion:
Neurogenic bladder or other neurologic disorder impacting bladder function such as Parkinson's disease, multiple sclerosis, cerebral vascular accident or diabetes

Annotated entities:
- Condition: "Neurogenic bladder"
- Condition: "neurologic disorder impacting bladder function"
- Condition: "Parkinson's disease"
- Condition: "multiple sclerosis"
- Condition: "cerebral vascular accident"
- Condition: "diabetes"